Long-standing persistent or permanent atrial fibrillation.

The above is a clinical trial exclusion criterion. Annotated with entity spans:
Long-standing [Qualifier: persistent] or [Qualifier: permanent] [Condition: atrial fibrillation].